下列何者不是決定肌肉張力的因素？
A. 肌纖維收縮的數量
B. 每一個運動單位下收縮的肌纖維比例
C. 參與收縮的運動單位數目
D. 運動神經元刺激的頻率

正確答案：B. 每一個運動單位下收縮的肌纖維比例